45 歲男性換心手術 6 個月後，定期接受心內膜心肌切片（endomyocardial biopsy）時發現有急性排斥，此時病人心臟內最可能的病理變化是：
A. 動脈血管硬化病變
B. 間質淋巴球浸潤及心肌細胞損傷
C. 多發性微小心肌梗塞壞死
D. 間質纖維化

正確答案：B. 間質淋巴球浸潤及心肌細胞損傷